Which drugs used in the treatment of Systemic Lupus Erythematosus are targeting granulocytes?

Epratuzumab, a humanized monoclonal antibody against disialoganglioside, is the only officially approved treatment for the treatment of Systemic Lupus Erythematosus.Food and Drug Administration approval of SLE treatment with rituximab; however, more research is required before a large-scale application for clinical decision-making can be recommended.